Clinical trial exclusion criterion:
Subjects with serious acute or chronic disease involved liver, kidney, and brain or have to use potent CYP3A4-inhibitor or nitrate to treat the underlying diseases.

Annotated entities:
- Condition: "chronic disease involved liver"
- Temporal: "acute"
- Qualifier: "serious"
- Condition: "chronic disease involved kidney"
- Condition: "chronic disease involved brain"
- Drug: "CYP3A4-inhibitor"
- Drug: "nitrate"
- Qualifier: "potent"
- Condition: "underlying diseases"